Clinical trial exclusion criterion:
Females who are pregnant, become to be pregnant or breastfeeding or males whose partners are pregnant, become to be pregnant or breastfeeding.

Entity relations:
- Has_context("pregnant", "become")
- OR("pregnant", "males")
- OR("Females", "males")
- OR("pregnant", "males")
- OR("breastfeeding", "males")